Clinical trial exclusion criterion:
Current punctal plugging

Entity relations:
- Has_temporal("punctal plugging", "Current")